Clinical trial exclusion criterion:
Impaired liver function (ALT > 120 U/L)

Entity relations:
- Has_value("ALT", "> 120 U/L")
- Subsumes("Impaired liver function", "ALT")